What is the function of the protein Cuf1?

Cuf1 is a copper-sensing transcription factor.